Ubiquitination 與下列何項敘述有關？
A. 蛋白質降解（degradation）
B. 胺基酸降解
C. RNA 降解
D. 醣類降解

正確答案：A. 蛋白質降解（degradation）